Clinical trial exclusion criteria:
previous unusual response to esmolol
inclusion in other randomized studies
esmolol administration in the previous 30 days
emergency operation

Annotated entities:
- Condition: "unusual response"
- Drug: "esmolol"
- Competing_trial: "inclusion in other randomized studies"
- Drug: "esmolol"
- Temporal: "in the previous 30 days"
- Procedure: "operation"
- Qualifier: "emergency"